How does adrenergic signaling affect thyroid hormone receptors?

alpha1- adrenergic signalling  increases  TRalpha1 expression in nucleus and  decreases  TRalpha1 expression in cytosol.